PGD patients

The above is a clinical trial exclusion criterion. Annotated with entity spans:
[Procedure: PGD] patients